Clinical trial exclusion criterion:
Abdominal ultrasound display the contractibility of gallbladder is poor.

Entity relations:
- Has_value("contractibility of gallbladder", "poor")
- AND("Abdominal ultrasound", "contractibility of gallbladder")